Clinical trial inclusion criterion:
4. Patient with at least an assessment of the response to Eribulin

Annotated entities:
- Parsing_Error: "4."
- Drug: "Eribulin"
- Procedure: "assessment of the response"
- Non-query-able: "Patient with at least an assessment of the response to Eribulin"